ASA I, II, III presenting for ambulatory surgery to be performed under general anesthesia

The above is a clinical trial inclusion criterion. Annotated with entity spans:
[Measurement: ASA] [Value: I], [Value: II], [Value: III] presenting for [Procedure: ambulatory surgery] to be performed [Qualifier: under general anesthesia]